Clinical trial inclusion criterion:
Distal biliary obstruction consistent with pancreatic cancer, distal CBD cholangiocarcinoma or other periampullary malignancy

Entity relations:
- Has_qualifier("periampullary malignancy", "other")
- OR("pancreatic cancer", "distal CBD cholangiocarcinoma", "periampullary malignancy")